En la síntesis del DNA, las quinolonas actúan:
1. Uniéndose a la doble hélice y bloqueando así el progreso de la horquilla de replicación.
2. Intercalándose en la doble hélice y provocando así errores en la transcripción.
3. Sobre la DNA girasa.
4. Como análogos de nucleótidos que se incorporan al DNA.
5. Sobre las DNA polimerasas.

Respuesta correcta: 3. Sobre la DNA girasa.